關於肋膜積液（pleural effusion）的敘述，下列何者正確？
A. 漏出液（transudate）常在肺炎或病毒感染時發生
B. 滲出液（exudate）通常是清澈，蛋白質含量較低的液體
C. 滲出液（exudate）是肋膜液的LDH 比上血清的LDH比值小於0.6
D. 若因肺炎產生之肋膜積液，此液體之葡萄糖濃度通常下降，且小於60mg/dL

正確答案：D. 若因肺炎產生之肋膜積液，此液體之葡萄糖濃度通常下降，且小於60mg/dL